History of hypertensive encephalopathy or cerebrovascular accident at any time prior to Visit1.

The above is a clinical trial exclusion criterion. Annotated with entity spans:
[Temporal: History] of [Condition: hypertensive encephalopathy] or [Condition: cerebrovascular accident] at [Temporal: any time prior] to Visit1.